Clinical trial inclusion criterion:
Postural instability and gait disturbance phenotype

Entity relations:
- OR("Postural instability", "gait disturbance")